Clinical trial exclusion criterion:
Patients with thrombosis within the hepatic, portal, or mesenteric veins.

Entity relations:
- Has_qualifier("thrombosis", "hepatic veins")
- OR("hepatic veins", "mesenteric veins", "portal veins")